4歲男童因有自閉行為（Autistic behavior）而就診，出生時的基本新生兒篩檢及常規染色體檢查並無異常。身體診察顯示頭圍正常、臉型稍長、耳朵大、睪丸體積亦較同年紀男生大。其30歲的媽媽亦因遲遲未能再懷孕，經檢查發現有早發性卵巢衰竭。此男童最有可能患有下列何種疾病？
A. Asperger syndrome
B. Fragile X syndrome
C. Klinefelter syndrome
D. Tourette syndrome

正確答案：B. Fragile X syndrome